use of concurrent,non-stimulant psychoactive medication

The above is a clinical trial exclusion criterion. Annotated with entity spans:
use of [Temporal: concurrent],[Drug: non-stimulant psychoactive medication]